5. Near distance from the hospital (the patient can reach hospital within one hour )

The above is a clinical trial inclusion criterion. Annotated with entity spans:
[Parsing_Error: 5.] [Post-eligibility: Near distance from the hospital (the patient can reach hospital within one hour )]